Clinical trial exclusion criterion:
Diabetic ketoacidosis

Annotated entities:
- Condition: "Diabetic ketoacidosis"